一位懷孕 27 週女性，G2P2，分娩女嬰一名，女嬰剛出生時呼吸微弱不規則，沒有心跳，全身與四肢膚色藍紫。依 Apgar score，此女嬰於膚色之分項應得幾分？
A. 0
B. 1
C. 2
D. 3

正確答案：A. 0